Severe hepatic impairment (eg, ascites and/or clinical signs of coagulopathy)

The above is a clinical trial exclusion criterion. Annotated with entity spans:
[Condition: Severe hepatic impairment] (eg, [Condition: ascites] and/or [Mood: clinical signs of] [Condition: coagulopathy])